Clinical trial exclusion criterion:
Subject who is pregnant or breast feeding, or planning to become pregnant during treatment and within 2 months after the discontinuation of study treatment.

Annotated entities:
- Condition: "pregnant"
- Observation: "breast feeding"
- Observation: "become pregnant"
- Temporal: "during treatment"
- Temporal: "within 2 months after the discontinuation of study treatment"
- Reference_point: "the discontinuation of study treatment"
- Reference_point: "treatment"
- Mood: "planning to"